Clinical trial inclusion criterion:
Left ventricular ejection fraction > 25%

Annotated entities:
- Measurement: "Left ventricular ejection fraction"
- Value: "> 25%"